Clinical trial exclusion criterion:
Pre-existing use of narcotics or opioids

Annotated entities:
- Drug: "narcotics"
- Drug: "opioids"
- Temporal: "Pre-existing"